Un bebe de seis meses ha aprendido a coger el sonajero y los agita para que suene. El resultado le gusta y lo vuelve a agitar repetidamente. Este comportamiento es un ejemplo típico de:
1. Reacción circular secundaria.
2. Asimilación.
3. Reacción circular terciaria.
4. Acomodación.

Respuesta correcta: 1. Reacción circular secundaria.